Has been previously treated with sugammadex or has participated in a sugammadex clinical trial.

The above is a clinical trial exclusion criterion. Annotated with entity spans:
Has been [Temporal: previously] treated with [Drug: sugammadex] or has [Observation: participated in] a [Drug: sugammadex] clinical trial.